Hypertensive disorders of pregnancy,

The above is a clinical trial exclusion criterion. Annotated with entity spans:
[Condition: Hypertensive disorders of pregnancy],